Clinical trial exclusion criterion:
Known hypersensitivity to any of the drugs given

Annotated entities:
- Condition: "hypersensitivity"
- Drug: "drugs"